Clinical trial inclusion criterion:
Angiographically defined total occlusion over 3 months

Annotated entities:
- Condition: "total occlusion"
- Qualifier: "Angiographically defined"
- Temporal: "3 months"